接觸或暴露於重金屬之危害已陸續被發現與許多健康效應有關。下列各項組合中那一組之因果相關性最低？
A. 錳－巴金森氏徵候群
B. 汞－水俁病
C. 砷－烏腳病
D. 鉻－致畸胎

正確答案：D. 鉻－致畸胎